Describe PWMScan

PWMScan is a fast web-based tool to scan server-resident genomes for matches to a user-supplied PWM or transcription factor binding site model from a public database. It is available for pre-assembled copies of the original PWM/TF binding model.